Clinical trial exclusion criterion:
Subjects who have ever received treatment with biological based therapy example, omalizumab, mepolizumab, for asthma.

Entity relations:
- AND("treatment", "omalizumab")
- OR("omalizumab", "mepolizumab", "asthma")